Clinical trial inclusion criterion:
At least 18 years of age

Entity relations:
- Has_value("age", "At least 18 years")